Clinical trial inclusion criteria:
At least 18 years of age
No more than 20 wk of gestation
Given Ante-natal Cards of the Ghana Health Service
Completed the initial routine ante-natal examination at the clinics
HIV negative or status unknown (as from the Ante-natal card)
Free from chronic disease e.g. malignancy requiring frequent medical attention (as from the Ante-natal card)
Residing in the Manya Krobo or Yilo Krobo district
Prepared to sign an informed consent
Living in the area throughout the duration of the study
Acceptance of home visitors

Annotated entities:
- Value: "At least 18 years"
- Person: "age"
- Value: "No more than 20 wk"
- Measurement: "gestation"
- Condition: "gestation"
- Non-representable: "Given Ante-natal Cards of the Ghana Health Service"
- Condition: "routine ante-natal examination"
- Visit: "clinics"
- Condition: "HIV"
- Negation: "negative"
- Qualifier: "status unknown"
- Condition: "chronic disease"
- Condition: "malignancy"
- Visit: "Manya Krobo district"
- Visit: "Yilo Krobo district"
- Observation: "Residing"
- Post-eligibility: "Prepared to sign an informed consent"
- Observation: "Living in the area"
- Temporal: "throughout the duration of the study"
- Reference_point: "the study"
- Post-eligibility: "Acceptance of home visitors"